Hombre de 38 años que consulta por disnea y hemoptisis. En los análisis de sangre tiene creatinina 7 mg/dl, urea 250 mg/dl y anti-MBG (anticuerpos anti membrana basal glomerular) positivos a título alto. Se realiza biopsia renal que muestra semilunas en el 75% de los glomérulos y en la inmunofluorecencia aparece un patrón depósito lineal de Ig. ¿Cuál de las siguientes es la respuesta correcta?
1. Se trata de una Nefropatía Ig A con fracaso renal agudo.
2. Estaría indicada la realización de plasmaféresis.
3. Se trata de una Glomerulonefritis membranosa.
4. El micofenolato mofetilo es el tratamiento inicial de elección.
5. La afectación glomerular esta causada por la presencia de inmunocomplejos circulantes.

Respuesta correcta: 2. Estaría indicada la realización de plasmaféresis.